Clinical trial inclusion criterion:
Patient has necessary mental capacity to participate and is able to comply with study protocol requirements;

Annotated entities:
- Post-eligibility: "Patient has necessary mental capacity to participate and is able to comply with study protocol requirements"